Clinical trial exclusion criterion:
severe hepatic or renal dysfunction;

Annotated entities:
- Condition: "renal dysfunction"
- Condition: "hepatic dysfunction"
- Qualifier: "severe"